在亨利氏彎管上行枝粗管細胞的管腔膜（Apical membrane）上，下列何種同向運輸（Symport）可造成鈉的再吸收？
A. Na+-glucose
B. Na+-Cl－
C. Na+-phosphate
D. Na+-K+-2Cl－

正確答案：D. Na+-K+-2Cl－